Clinical trial exclusion criteria:
DSM-IV-TR substance-related disorders (except nicotine)
significant medical or neurological conditions
mental retardation or organic brain damage

Annotated entities:
- Qualifier: "DSM-IV-TR"
- Condition: "substance-related disorders"
- Drug: "nicotine"
- Negation: "except"
- Post-eligibility: "significant medical or neurological conditions"
- Condition: "mental retardation"
- Condition: "organic brain damage"